With good oral hygiene;

The above is a clinical trial inclusion criterion. Annotated with entity spans:
With [Observation: good oral hygiene];